Clinical trial inclusion criterion:
Early, intermediate, advanced, non metastatic Hepatocellular Carcinoma. Indication for radioembolization validated after pluridisciplinary committee meeting.

Entity relations:
- Has_negation("metastatic", "non")
- Has_qualifier("Hepatocellular Carcinoma", "metastatic")
- Has_qualifier("Hepatocellular Carcinoma", "Early")
- Has_context("radioembolization", "Indication")
- OR("Early", "intermediate", "advanced")